American Society of Anesthesiologists Physical Status IV or V

The above is a clinical trial exclusion criterion. Annotated with entity spans:
[Measurement: American Society of Anesthesiologists Physical Status] [Value: IV or V]